List orally bioavailable MPS1 kinase inhibitors

1 h-pyrrolo [3,2-c] pyridine, cct271850, nms-p715, 4-aminopyrazalo,bos172722 and cct251455.